Clinical trial inclusion criterion:
breast cancer ( DIN 2 e 3, o LIN 2 e 3 sec. Tavassoli) scheduled for nipple-sparing mastectomy, simple mastectomy, skin-sparing mastectomy, skin-reducing mastectomy c, lymphnode biopsy and axillary dissection;

Entity relations:
- Has_value("DIN", "2 e 3")
- Has_value("LIN", "2 e 3 sec")
- Has_mood("nipple-sparing mastectomy", "scheduled for")
- Subsumes("breast cancer", "DIN")
- OR("DIN", "LIN")
- OR("breast cancer", "simple mastectomy", "lymphnode biopsy", "axillary dissection", "skin-reducing mastectomy", "skin-sparing mastectomy", "nipple-sparing mastectomy")